檸檬酸循環（citric acid cycle）的代謝物（metabolite）中，何者作為卟啉（porphyrin）生合成的前體 （precursor）？
A. oxaloacetate
B. alpha-ketoglutarate
C. citrate
D. succinyl CoA

正確答案：D. succinyl CoA